一位罹患深部靜脈血栓已接受口服 warfarin 治療二個月的患者，INR（international normalized ratio）正控制在理想的範圍時，若再合併使用下列何種藥物，可能會減弱 warfarin 的藥效？
A. Rifampin
B. Amiodarone
C. Cimetidine
D. Ketoconazole

正確答案：A. Rifampin